El uso de un instrumento que evalúe el grado de sugestionabilidad es de utilidad en el diagnóstico diferencial de:
1. Es trastorno obsesivo compulsivo (TOC).
2. Los problemas disociativos.
3. La ansiedad generalizada.
4. Los trastornos de personalidad.

Respuesta correcta: 2. Los problemas disociativos.